Clinical trial exclusion criterion:
Current or recent treatment with pegylated interferon (PEG-IFN).

Entity relations:
- Subsumes("pegylated interferon", "PEG-IFN")
- AND("treatment", "pegylated interferon")
- Has_temporal("treatment", "Current")
- OR("Current", "recent")